Clinical trial exclusion criterion:
Patients in whom the preferred treatment is CABG(Coronary artery bypass grafting)

Entity relations:
- Subsumes("CABG", "Coronary artery bypass grafting")